Clinical trial exclusion criteria:
Pregnancy
Known hypersensitivity to study drug (ferric carboxymaltose or equivalent) or its excipients
Known or suspected haemoglobinopathy/thalassaemia
Bone marrow disease
Haemochromatosis
Renal dialysis
Erythropoietin or IV iron in the previous 4 weeks

Annotated entities:
- Condition: "Pregnancy"
- Condition: "hypersensitivity"
- Drug: "study drug"
- Drug: "ferric carboxymaltose"
- Condition: "haemoglobinopathy"
- Condition: "thalassaemia"
- Mood: "suspected"
- Mood: "Known"
- Condition: "Bone marrow disease"
- Condition: "Haemochromatosis"
- Procedure: "Renal dialysis"
- Drug: "Erythropoietin"
- Drug: "IV iron"
- Temporal: "in the previous 4 weeks"